Clinical trial exclusion criterion:
Use of medications that alter the absorption or metabolism of levothyroxine

Entity relations:
- multi("metabolism of levothyroxine", "levothyroxine")
- multi("absorption of levothyroxine", "levothyroxine")
- Has_negation("absorption of levothyroxine", "alter")
- Has_context("medications", "absorption of levothyroxine")
- OR("absorption of levothyroxine", "metabolism of levothyroxine")